Clinical trial exclusion criterion:
patients previously included in this study (for patients who have second intra-abdominal surgery during the study period).

Annotated entities:
- Non-query-able: "patients previously included in this study (for patients who have second intra-abdominal surgery during the study period)."